Clinical trial exclusion criterion:
Coagulopathy or bleeding tendency caused by organ dysfunction, such as cirrhosis, bone marrow suppression etc.

Annotated entities:
- Condition: "Coagulopathy"
- Condition: "bleeding tendency"
- Condition: "organ dysfunction"
- Condition: "cirrhosis"
- Condition: "bone marrow suppression"